What is known about potential implication of thyroid hormone receptors in arterial hypertension?

An associations between the THRA rs939348 polymorphism and systolic BP and the risk of hypertension has been observed
The levels of the three thyroid hormone receptors isoforms do not differ significantly between spontaneous hypertensive rats and control rats of the same age, either in the left or in the right ventricle.
The published results are still unconclusive.